En contraste con los bacterianos, los cromosomas eucarióticos necesitan múltiples orígenes de replicación porque:
1. No pueden replicarse bidireccionalmente.
2. No suelen ser circulares.
3. La procesividad de la ADN polimerasa eucariótica es muy inferior a la de la bacteriana.
4. Su tasa de replicación es mucho más lenta, y necesitarían demasiado tiempo usando un solo origen.
5. Tienen varias ADN polimerasas para distintos propósitos, y necesitan la correspondiente variedad de orígenes.

Respuesta correcta: 4. Su tasa de replicación es mucho más lenta, y necesitarían demasiado tiempo usando un solo origen.